Hemodynamic unstable

The above is a clinical trial exclusion criterion. Annotated with entity spans:
[Condition: Hemodynamic unstable]